signed informed consent

The above is a clinical trial inclusion criterion. Annotated with entity spans:
[Observation: signed informed consent]